Pregnant women or women who are uncertain about a possible pregnancy

The above is a clinical trial exclusion criterion. Annotated with entity spans:
[Condition: Pregnant] women or women who are [Non-query-able: uncertain about a possible pregnancy]